Clinical trial exclusion criterion:
A failed therapeutic trial of escitalopram in the current depressive episode (defined as at least 6 weeks of treatment at a daily dose of 10mg or higher)

Entity relations:
- Has_qualifier("therapeutic trial", "failed")
- AND("therapeutic trial", "escitalopram")
- multi("depressive episode", "depressive episode")
- AND("in the current depressive episode", "depressive episode")
- Subsumes("in the current depressive episode", "at least 6 weeks of treatment")
- Has_temporal("escitalopram", "in the current depressive episode")
- Has_index("in the current depressive episode", "depressive episode")
- Subsumes("in the current depressive episode", "daily dose of 10mg or higher")